Clinical trial exclusion criterion:
History of drug abuse or alcohol abuse in the past 12 months.

Entity relations:
- Has_temporal("drug abuse", "in the past 12 months")
- Has_temporal("drug abuse", "History")
- OR("drug abuse", "alcohol abuse")